Has current signs or symptoms of significant medical illness which could interfere with the trial, or require treatment that might interfere with the trial

The above is a clinical trial exclusion criterion. Annotated with entity spans:
Has current signs or symptoms of [Qualifier: significant] [Condition: medical illness] which could [Observation: interfere with the trial], or [Mood: require] [Procedure: treatment] that might [Observation: interfere with the trial]